Clinical trial exclusion criterion:
Serum alanine transaminase > 3 times upper limit of normal

Annotated entities:
- Measurement: "Serum alanine transaminase"
- Value: "> 3 times upper limit of normal"